Clinical trial exclusion criterion:
Smokers of > 5 cigarettes a day.

Entity relations:
- Has_multiplier("cigarettes", "> 5 a day")